¿Cuál de las siguientes afirmaciones es CORRECTA respecto a las técnicas subjetivas?
1. La evaluación, potencia y actividad son dimensiones características de la técnica de la rejilla.
2. En el Diferencial Semántico los constructos o adjetivos son elegidos por el evaluado.
3. Es posible obtener “constructos dilemáticos” con el diferencial semántico.
4. Es posible obtener “dilemas implicativos” con la técnica de la rejilla interpersonal.
5. Con el Diferencial semántico se obtienen índices cognitivos.

Respuesta correcta: 4. Es posible obtener “dilemas implicativos” con la técnica de la rejilla interpersonal.